下列有關腎細胞癌（renal cell carcinoma）接受根治性手術治療的敘述，何者正確？
A. 不論腫瘤長在腎臟任何位置，同側之腎上腺均必須一併切除
B. 腎門附近之淋巴腺組織是否須一併清除，目前尚未定論
C. 腎臟腫瘤如未切除乾淨，術後再加上局部放射治療，可以有效地延長病人之存活
D. 術前每人應均先接受腎動脈栓塞，因為這樣可以有效地減少術中出血

正確答案：B. 腎門附近之淋巴腺組織是否須一併清除，目前尚未定論